Clinical trial exclusion criterion:
Has had a minor surgery ≤7 days prior to the first dose of study medication

Annotated entities:
- Procedure: "minor surgery"
- Temporal: "≤7 days prior"
- Reference_point: "first dose of study medication"